Clinical trial exclusion criterion:
Bacterial infection origin from another organ (e.g. pneumonia)

Entity relations:
- Has_qualifier("Bacterial infection", "another organ")
- Subsumes("Bacterial infection", "pneumonia")